Clinical trial exclusion criterion:
Patients with history of chronic liver disease, cancer or connective tissue disorders.

Entity relations:
- Has_temporal("chronic liver disease", "history")
- OR("chronic liver disease", "connective tissue disorders", "cancer")